Clinical diagnosis of a Grade I or II ankle sprain

The above is a clinical trial inclusion criterion. Annotated with entity spans:
Clinical diagnosis of a [Qualifier: Grade I] or II [Condition: ankle sprain]